1. Justification: the population of interest here is a healthy control population with no present or past substance use disorder.

The above is a clinical trial exclusion criterion. Annotated with entity spans:
[Parsing_Error: 1.] [Parsing_Error: Justification: the population of interest here is a healthy control population with no present or past substance use disorder.]